Clinical trial exclusion criterion:
Known major fetal structural or chromosomal abnormality.

Annotated entities:
- Condition: "chromosomal abnormality"
- Condition: "fetal structural"
- Qualifier: "major"